Evidence of hepatocellular carcinoma at the time of enrollment

The above is a clinical trial exclusion criterion. Annotated with entity spans:
Evidence of [Condition: hepatocellular carcinoma] at the time of enrollment